預防接種是屬於公共衛生預防原則中的那一段？
A. 初段預防（Primary prevention）
B. 次段預防（Secondary prevention）
C. 三段預防（Tertiary prevention）
D. 四段預防（Quarterary prevention）

正確答案：A. 初段預防（Primary prevention）